History of acute coronary syndrome in the past 30 days.

The above is a clinical trial exclusion criterion. Annotated with entity spans:
History of [Condition: acute coronary syndrome] [Temporal: in the past 30 days].